Clinical trial exclusion criterion:
Subject is, in the opinion of the Investigator, unable to complete the 6 week Observation period and the EPT assessments as required.

Annotated entities:
- Non-query-able: "Subject is, in the opinion of the Investigator, unable to complete the 6 week Observation period and the EPT assessments as required"